Clinical trial exclusion criterion:
Known IgE( Immunoglobulin E)-mediated hypersensitivity to eggs manifested as hives, swelling of the mouth and throat, difficulty in breathing, hypotension, or shock

Annotated entities:
- Condition: "IgE( Immunoglobulin E)-mediated hypersensitivity"
- Drug: "eggs"
- Condition: "hives"
- Condition: "swelling of the mouth and throat"
- Condition: "difficulty in breathing"
- Condition: "hypotension"
- Condition: "shock"